一位嬰兒注視	檢查者，眼睛隨	他的移動而轉動，並且對	他笑，但是沒有笑出聲音，手微張開，扶	肩膀時頭才會挺直。這位正常嬰兒的發展年齡最可能是幾個月大？
A. 1
B. 2
C. 4
D. 6

正確答案：B. 2